Clinical trial exclusion criterion:
6. Subject/Caregiver is unable to provide consent.

Annotated entities:
- Parsing_Error: "6."
- Non-query-able: "Subject/Caregiver is unable to provide consent."
- Post-eligibility: "Subject/Caregiver is unable to provide consent."